有關 fomivirsen 之敘述中，下列何者錯誤？
A. 是一 phosphorothioate oligonucleotide
B. 主要作用為抑制病毒之 DNA polymerase
C. 可用於局部治療巨細胞病毒（CMV）引起之視網膜炎
D. 有增加眼內壓之副作用

正確答案：B. 主要作用為抑制病毒之 DNA polymerase